Clinical trial inclusion criteria:
normal full term single pregnancy
age 18 years or more
BMI 20 - 35 kg/m2
written informed consent obtained

Annotated entities:
- Condition: "pregnancy"
- Multiplier: "single"
- Qualifier: "normal"
- Qualifier: "full term"
- Person: "age"
- Value: "18 years or more"
- Measurement: "BMI"
- Value: "20 - 35 kg/m2"
- Post-eligibility: "written informed consent obtained"